Clinical trial inclusion criterion:
KPS= 70

Annotated entities:
- Measurement: "KPS"
- Value: "= 70"